How does dabigatran therapy affect aPTT in patients with atrial fibrillation?

Dabigatran increases aPTT in patients with atrial fibrillation, although aPTT does not respond linearily to dabigatran therapy.